Clinical trial inclusion criterion:
Upper GIB secondary to bleeding esophageal varices as show by esophageal endoscopy, requiring endoscopic band ligation (EBL) at presentation

Annotated entities:
- Condition: "Upper GIB"
- Qualifier: "secondary"
- Qualifier: "bleeding"
- Condition: "esophageal varices"
- Procedure: "esophageal endoscopy"
- Mood: "requiring"
- Procedure: "endoscopic band ligation (EBL)"
- Temporal: "at presentation"